La insulina:
1. Disminuye la formación de glucógeno en el hígado.
2. Disminuye la captación de potasio al interior celular.
3. Aumenta la captación de glucosa al interior celular.
4. Aumenta la concentración de aminoácidos en sangre.

Respuesta correcta: 3. Aumenta la captación de glucosa al interior celular.